有關幼年性特發性關節炎（juvenile idiopathic arthritis）中的系統性關節炎（systemic-onset arthritis）敘述，下列何者正確？
A. 不會有肝、脾腫大
B. 不會有淋巴腺腫大及心包膜炎
C. 經常併發慢性葡萄膜炎（chronic uveitis）
D. 發燒時常伴隨皮膚疹

正確答案：D. 發燒時常伴隨皮膚疹